下列抑癌基因，何者不直接調控細胞週期（G1→S）？
A. RB
B. E-cadherin
C. p16/INK4a
D. p53

正確答案：B. E-cadherin